Cuando se realiza la determinación de hormonas tiroideas (tirotropina y T4 libre) en paciente con hipotiroidismo secundario encontramos:
1. Tirotropina (TSH) elevada.
2. Tirotropina (TSH) disminuida.
3. Tirotropina (TSH) normal.
4. Tiroxina libre (T4 L) elevada.

Respuesta correcta: 2. Tirotropina (TSH) disminuida.